written informed consent

The above is a clinical trial inclusion criterion. Annotated with entity spans:
[Informed_consent: written informed consent]